Gestational diabetes;

The above is a clinical trial exclusion criterion. Annotated with entity spans:
[Condition: Gestational diabetes];